Patients with chronic respiratory failure

The above is a clinical trial exclusion criterion. Annotated with entity spans:
Patients with [Condition: chronic respiratory failure]